Participant has a clinically significant abnormal physical examination, vital signs or 12 lead ECG (including QTc greater than (>) 450msec, Left Bundle Branch Block, permanent pacemaker or implantable cardioverter defibrillator) at Screening or admission

The above is a clinical trial exclusion criterion. Annotated with entity spans:
Participant has a [Undefined_semantics: clinically significant] [Condition: abnormal physical examination], vital signs or 12 lead ECG (including [Measurement: QTc] [Value: greater than (>) 450msec], [Condition: Left Bundle Branch Block], [Device: permanent pacemaker] or [Condition: implantable cardioverter defibrillator]) [Temporal: at Screening or admission]